Clinical trial inclusion criterion:
Meets Diagnostic and Statistical Manual of Mental Disorders (Versions 4 and 5) criteria for and Major Depressive Disorder.

Entity relations:
- Has_qualifier("Diagnostic and Statistical Manual of Mental Disorders criteria", "Versions 4")
- AND("Diagnostic and Statistical Manual of Mental Disorders criteria", "Major Depressive Disorder")
- OR("Versions 4", "Versions 5")